兩眼往右上方向看時，其共軛肌（yoke muscles）為下列那一組？
A. 右上直肌（right superior rectus muscle）和左下斜肌（left inferior oblique muscle）
B. 右上斜肌（right superior oblique muscle）和左下斜肌（left inferior oblique muscle）
C. 右上斜肌（right superior oblique muscle）和左上直肌（left superior rectus muscle）
D. 右下斜肌（right inferior oblique muscle）和左上直肌（left superior rectus muscle）

正確答案：A. 右上直肌（right superior rectus muscle）和左下斜肌（left inferior oblique muscle）